What is the inheritance of the glucose-6-phosphate dehydrogenase (G6PD) deficiency?

Glucose-6-phosphate dehydrogenase (G6PD) deficiency is the commonest red cell enzymopathy in humans and has a recessive X-linked inheritance.